一場大地震之後，不少人發生急性腎衰竭（Acute renal failure, ARF），最常見的原因為：
A. 血紅素尿性急性腎衰竭（Hemoglobinuric ARF）
B. 肌球蛋白尿性急性腎衰竭（Myoglobinuric ARF）
C. 急性間質性腎炎（Acute interstitial nephritis）
D. 急性腎小球腎炎（Acute glomerulonephritis）

正確答案：B. 肌球蛋白尿性急性腎衰竭（Myoglobinuric ARF）